Clinical trial exclusion criteria:
Coronary artery disease - stent
Severe chronic renal failure
Congenital or acquired thrombophilia/thrombosis event
Known or suspected allergy

Annotated entities:
- Condition: "Coronary artery disease"
- Device: "stent"
- Qualifier: "Severe"
- Qualifier: "chronic"
- Condition: "renal failure"
- Qualifier: "Congenital"
- Qualifier: "acquired"
- Condition: "thrombophilia"
- Condition: "thrombosis event"
- Condition: "allergy"
- Mood: "Known"
- Mood: "suspected"